Clinical trial exclusion criterion:
Liver enzymes greater than 2 times ULN.

Entity relations:
- Has_value("Liver enzymes", "greater than 2 times ULN")